History of regular alcohol consumption within 6 months of the study defined as: An average weekly intake of >21 units for males or >14 units for females. One unit is equivalent to 8 gram of alcohol: a half-pint (approximately 240 milliliter [mL]) of beer, 1 glass (100 mL) of wine or 1 (25 mL) measure of spirits.

The above is a clinical trial exclusion criterion. Annotated with entity spans:
[Temporal: History] of [Condition: regular alcohol consumption] [Temporal: within 6 months of the study] defined as: An [Measurement: average weekly intake] of [Value: >21 units] for [Person: males] or [Value: >14 units] for [Person: females]. [Parsing_Error: One unit is equivalent to 8 gram of alcohol: a half-pint (approximately 240 milliliter [mL]) of beer, 1 glass (100 mL) of wine or 1 (25 mL) measure of spirits.]